下列關於泌尿道尿酸結石的敘述，何者正確？
A. 約占所有尿路結石之 30%
B. 常發生於老年人、慢性臥床及癌症病患治療時
C. 尿液酸鹼度（pH 值）必介於 6.5-7.0 之間
D. 鹼化尿液可有效溶解結石

正確答案：D. 鹼化尿液可有效溶解結石